ongoing trauma (e.g. current involvement in an abusive relationship).

The above is a clinical trial exclusion criterion. Annotated with entity spans:
[Temporal: ongoing] [Condition: trauma] (e.g. [Temporal: current] [Condition: involvement in an abusive relationship]).